Patients participating in previous, concurrent or not, trials (ongoing or completed within three months);

The above is a clinical trial exclusion criterion. Annotated with entity spans:
Patients participating in [Temporal: previous], concurrent or not, [Observation: trials] ([Qualifier: ongoing] or [Qualifier: completed] [Temporal: within three months]);